Clinical trial exclusion criterion:
BMI less than 18.5

Entity relations:
- Has_value("BMI", "less than 18.5")